En la teoría bifactorial de Mowrer para la explicación de la adquisición y mantenimiento de las Fobias Especificas ¿Cuál es el papel del Condicionamiento Operante?:
1. Juega un papel fundamental en la adquisición del miedo.
2. Juega un papel fundamental en el mantenimiento del miedo.
3. Juega un papel fundamental tanto en la adquisición como en el mantenimiento del miedo.
4. En realidad el Condicionamiento Operante no juega papel alguno en la teoría, ya que se basa únicamente en el Condicionamiento Clásico.

Respuesta correcta: 2. Juega un papel fundamental en el mantenimiento del miedo.